Which is the primary interacting protein of BLK?

Genetic and physical interaction of the B-cell systemic lupus erythematosus-associated genes BANK1 and BLK. a genetic interaction between BANK1 and BLK, and demonstrates that these molecules interact physically.